IIEF < 21

The above is a clinical trial exclusion criterion. Annotated with entity spans:
[Measurement: IIEF] [Value: < 21]